醫療人員抽血時被針頭扎傷，若患者有以下何種疾病，而醫療人員本身原未有保護性之抗體，其經血液傳染該疾病之機率為最高？
A. B 型肝炎（hepatitis B）
B. C 型肝炎（hepatitis C）
C. 人類免疫不全病毒（HIV）引起之症侯群
D. 梅毒（syphilis）

正確答案：A. B 型肝炎（hepatitis B）